Which genetic susceptibility loci are implicated in irritable bowel syndrome (IBS)?

There have been six genetic susceptibility loci identified and confirmed for IBS. Implicated genes included NCAM1, CADM2, PHF2/FAM120A, DOCK9, CKAP2/TPTE2P3 and BAG6.